Women who are pregnant or breastfeeding

The above is a clinical trial exclusion criterion. Annotated with entity spans:
[Person: Women] who are [Observation: pregnant] or [Observation: breastfeeding]